Clinical trial exclusion criterion:
Chronic liver disease (Cirrhosis, malignancy and patients with more than twice the upper limit of liver function tests)

Entity relations:
- Has_value("liver function tests", "more than twice the upper limit")
- Subsumes("Chronic liver disease", "Cirrhosis")
- OR("Cirrhosis", "malignancy", "liver function tests")